History of allergic disease or reactions likely to be exacerbated by any component of the vaccine (including egg and thiomersal allergy).

The above is a clinical trial exclusion criterion. Annotated with entity spans:
[Temporal: History] of [Condition: allergic disease] or reactions likely to be exacerbated by any component of the vaccine (including [Condition: egg] and [Condition: thiomersal allergy]).